同時考慮敏感性（sensitivity）與專一性（specificity）時，下列那一種腫瘤標記（tumor marker）最適合篩檢所述的癌症？
A. 攝護腺特定抗原（prostate specific antigen, PSA）－攝護腺癌
B. 癌抗原 CA-125－卵巢癌
C. 癌胚胎抗原（carcinoembryonic antigen, CEA）－大腸直腸癌
D. 癌抗原 CA-15-3－乳癌

正確答案：A. 攝護腺特定抗原（prostate specific antigen, PSA）－攝護腺癌